Clinical trial inclusion criterion:
Diagnosis of Heart Failure;

Annotated entities:
- Condition: "Heart Failure"